Clinical trial exclusion criterion:
Electroconvulsive therapy in last 6 months

Annotated entities:
- Procedure: "Electroconvulsive therapy"
- Temporal: "in last 6 months"